BMI 18-35

The above is a clinical trial inclusion criterion. Annotated with entity spans:
[Measurement: BMI] [Value: 18-35]